Clinical trial exclusion criterion:
ongoing trauma (e.g. current involvement in an abusive relationship).

Annotated entities:
- Condition: "trauma"
- Temporal: "ongoing"
- Condition: "involvement in an abusive relationship"
- Temporal: "current"